Has contact lens best corrected distance vision worse than 20/25 (0.10 logMAR) in either eye.

The above is a clinical trial exclusion criterion. Annotated with entity spans:
Has [Measurement: contact lens best corrected distance vision] [Value: worse than 20/25] (0.10 logMAR) in either eye.